Describe the role of epidermal CYLD inactivation in sebaceous and basaloid skin tumors

The deubiquitinase-encoding CYLDM gene is a dominant genetic linkage to a wide spectrum of skin-appendage tumors, which could be collectively designated as CYLD mutant-syndrome (CYLDM-Syndrome). It's a dominant gene in the basaloid and sebaceous regions of the epidermis, which is the outermost layer of the skin. When it's mutated, it can lead to a variety of skin tumors.